Clinical trial exclusion criterion:
Evolutive skin disease on the testing zone (lower back).

Annotated entities:
- Condition: "Evolutive skin disease"
- Qualifier: "testing zone"
- Qualifier: "lower back"